一位47歲的女性，近三年來有輕度口渴、掉髮、冬天手指頭會變白及變紫。另外，在手掌及手背有明顯的微 血管擴張（telangiectasis）。近半年有吞嚥障礙。經抽血檢查發現ANA 1：160 centromere pattern，C3 
 108 mg/dL，C4 23.5 mg/dL，anti-Scl-70 85 AU/mL（normal <120 AU/mL），anti-centromere protein 218  AU/mL（normal<120 AU/mL），anti-SSA 128 AU/mL（normal< 120 AU/mL），anti-dsDNA 108 IU/mL
 （normal<120IU/mL），anti-Sm/anti-RNP均為正常。最有可能的診斷為何？
A. polymyositis
B. CREST syndrome
C. Sjögren's syndrome
D. systemic lupus erythematosus

正確答案：B. CREST syndrome